patients with ectopic pregnancy;

The above is a clinical trial exclusion criterion. Annotated with entity spans:
patients with [Condition: ectopic pregnancy];